Clinical trial inclusion criterion:
The ability to comprehend and comply with protocol requirements.

Annotated entities:
- Post-eligibility: "The ability to comprehend and comply with protocol requirements"